Clinical trial exclusion criterion:
Allergy to metronidazole

Entity relations:
- AND("Allergy", "metronidazole")